Clinical trial exclusion criterion:
Has hepatitis C in which participants received therapy for HCV <4 weeks prior to receiving pembrolizumab

Entity relations:
- Has_index("<4 weeks prior", "receiving pembrolizumab")
- Has_temporal("therapy for HCV", "<4 weeks prior")
- AND("hepatitis C", "therapy for HCV")